Clinical trial exclusion criterion:
Current peripheral neuropathy of Grade ≥ 3.

Annotated entities:
- Condition: "peripheral neuropathy"
- Qualifier: "Grade ≥ 3"
- Measurement: "Grade"
- Value: "≥ 3"
- Temporal: "Current"